If female of childbearing potential: known pregnancy, or unwilling to practice anticontraceptive measures.

The above is a clinical trial exclusion criterion. Annotated with entity spans:
I[Pregnancy_considerations: f female of childbearing potential: known pregnancy, or unwilling to practice anticontraceptive measures].